¿Qué enzima controla principalmente la velocidad de la gluconeogénesis?:
1. Fosfofructoquinasa.
2. Piruvato quinasa.
3. Fructosa-1,6-bisfosfatasa.
4. Fosfoglucosa isomerasa.

Respuesta correcta: 3. Fructosa-1,6-bisfosfatasa.